Age less than one year or over 18 years

The above is a clinical trial exclusion criterion. Annotated with entity spans:
[Person: Age] [Value: less than one year] or [Value: over 18 years]